Clinical trial exclusion criterion:
Statins (dose must be ≤ half the maximum dose; must be on a stable dose ≥3 months);

Entity relations:
- Has_temporal("stable dose", "≥3 months")
- Has_multiplier("Statins", "≤ half the maximum dose")
- Has_qualifier("Statins", "stable dose")